Cuál de los compuestos siguientes en un intermediario fundamental de la síntesis de triacilgliceroles y fosfolípidos:
1. CDP-colina.
2. Fosfatidato.
3. Triglicérido.
4. Fosfatidilserina.
5. CDP-diacilglicerol.

Respuesta correcta: 2. Fosfatidato.